下列何者不屬於 DSM-IV 精神分裂症五種亞型？
A. 妄想型（paranoid type）
B. 混亂型（disorganized type）
C. 緊張型（catatonic type）
D. 分化型（differentiated type）

正確答案：D. 分化型（differentiated type）